Clinical trial exclusion criterion:
Patients with history of allergy to PEG.

Entity relations:
- AND("allergy", "PEG")
- Has_temporal("allergy", "history")